What organ is associated with a Gleason pattern or Gleason Score?

The Gleason score is an important parameter for clinical outcome in prostate cancer patients